Clinical trial exclusion criterion:
previous unusual response to esmolol

Annotated entities:
- Condition: "unusual response"
- Drug: "esmolol"